women previously diagnosed with generalized vulvodynia

The above is a clinical trial inclusion criterion. Annotated with entity spans:
[Person: women] previously diagnosed with [Condition: generalized vulvodynia]